Las enzimas de restricción se describen mejor por cuál de las afirmaciones siguientes:
1. Unen los extremos de las moléculas de DNA recombinante.
2. Confieren una ventaja selectiva a los bacteriófagos invasores.
3. Son enzimas que reconocen y metilan secuencias específicas de DNA.
4. Realizan cortes específicos de secuencia en ambas cadenas de un DNA dúplex.

Respuesta correcta: 4. Realizan cortes específicos de secuencia en ambas cadenas de un DNA dúplex.